Clinical trial exclusion criterion:
Smokers (current use or use over the previous 2 months of nicotine-containing substances, including tobacco products (e.g. cigarettes, cigars, chewing tobacco, gum, patch or electronic cigarettes)

Annotated entities:
- Person: "Smokers"